下列有關預防性篩檢（screening）的敘述，何者正確？
A. 陽性預測值（positive predictive value）不受疾病盛行率高低之影響
B. 以「五年存活率」評估篩檢措施的效益，易導致時距偏差（length-time bias）
C. 前導時間偏差（lead-time bias）是指進展慢的比進展快的個案，較易經由篩檢方式發現
D. 衡量某一疾病是否值得做預防性篩檢，殘障調整後之人年（disability-adjusted life year, DALY）是可行的指標

正確答案：D. 衡量某一疾病是否值得做預防性篩檢，殘障調整後之人年（disability-adjusted life year, DALY）是可行的指標